Any patient with esophageal cancer who is not deemed a surgical candidate or who is not deemed a candidate for the Ivor Lewis technique of esophagectomy (with intrathoracic anastomosis).

The above is a clinical trial exclusion criterion. Annotated with entity spans:
Any patient with [Condition: esophageal cancer] who is [Negation: not] deemed a [Procedure: surgical] [Observation: candidate] or who is [Negation: not] deemed a [Observation: candidate] for the [Qualifier: Ivor Lewis technique] of [Procedure: esophagectomy] ([Qualifier: with intrathoracic anastomosis]).